Clinical trial exclusion criterion:
Patients with ongoing infection including HIV and Hepatitis

Entity relations:
- Has_qualifier("infection", "ongoing")
- Subsumes("infection", "HIV")
- OR("HIV", "Hepatitis")